En un ensayo clínico realizado en mujeres posmenopáusicas con un nuevo bifosfonato frente a placebo, se obtiene como resultado una reducción del 20% de fracturas vertebrales radiológicas. ¿Cuál sería el NNT (número de pacientes que será necesario tratar) de esta intervención terapéutica en comparación con placebo?
1. 80.
2. 5.
3. 20.
4. 90.

Respuesta correcta: 2. 5.